Clinical trial inclusion criterion:
18-year or older patients

Entity relations:
- Has_value("old", "18-year or older")